Al disolver un soluto no volátil en un disolvente formando una disolución diluida, se observa:
1. Un aumento en la temperatura de congelación del disolvente.
2. Un aumento en la temperatura de ebullición del disolvente.
3. Un aumento en la presión de vapor del disolvente.
4. Un aumento en el potencial químico del disolvente.
5. Un cambio en las propiedades coligativas en función del tipo de soluto.

Respuesta correcta: 2. Un aumento en la temperatura de ebullición del disolvente.